Las enterotoxinas termolábil (LT) y termoestable (ST) son responsables de la diarrea causada por algunas cepas de:
1. Salmonella enterica.
2. Vibrio cholerae.
3. Campylobacter jejuni.
4. Yersinia enterocolitica.
5. Escherichia coli.

Respuesta correcta: 5. Escherichia coli.